1. For subjects in Cohort A: previous therapy for more than 48 hours with any parenteral antibiotic with activity against S. aureus within 72 hours of positive blood culture results.

The above is a clinical trial exclusion criterion. Annotated with entity spans:
1. For subjects in [Observation: Cohort A]: [Temporal: previous] [Procedure: therapy] [Temporal: for more than 48 hours] with any [Drug: parenteral antibiotic with activity against S. aureus] [Temporal: within 72 hours of positive blood culture results].